Disseminated Intravascular Coagulation (DIC) attributable to heparin-induced thrombocytopenia.

The above is a clinical trial exclusion criterion. Annotated with entity spans:
[Condition: Disseminated Intravascular Coagulation] ([Condition: DIC]) attributable to [Condition: heparin-induced thrombocytopenia].